下列何者不是肝昏迷的初期症狀？
A. 人格改變
B. 睡眠型態改變
C. 注意力不集中
D. 腹瀉

正確答案：D. 腹瀉